Clinical trial exclusion criterion:
Bradycardia (HR<55bpm)

Entity relations:
- Has_value("HR", "<55bpm")
- Subsumes("Bradycardia", "HR")